Clinical trial exclusion criterion:
Treatment with cyclophosphamide, leflunomide, or methotrexate for over 2 weeks, or use of biological agent(s) regardless of duration, within the past 6 months (Note: prior use of azathioprine, mizoribine, intravenous immunoglobulins and anti-malarials is allowed).

Annotated entities:
- Drug: "cyclophosphamide"
- Drug: "leflunomide"
- Drug: "methotrexate"
- Multiplier: "2 weeks"
- Procedure: "biological agent"
- Temporal: "past 6 months"
- Negation: "allowed"
- Drug: "azathioprine"
- Drug: "mizoribine"
- Drug: "immunoglobulins"
- Drug: "anti-malarials"